Clinical trial inclusion criterion:
Breast - Karnofsky score > 50;

Annotated entities:
- Measurement: "Breast - Karnofsky score"
- Value: "> 50"